Patients who have undergone surgery within 24 hours prior to the study sonographic examination.

The above is a clinical trial exclusion criterion. Annotated with entity spans:
Patients who have undergone [Procedure: surgery] [Temporal: within 24 hours prior to the study sonographic examination].